previous esophageal treatment by another method ablation: photodynamic therapy, argon plasma coagulation, laser, ....

The above is a clinical trial exclusion criterion. Annotated with entity spans:
[Temporal: previous] [Procedure: esophageal treatment] by [Qualifier: another method] [Procedure: ablation]: [Procedure: photodynamic therapy], [Procedure: argon plasma coagulation], [Procedure: laser], ....